Clinical trial exclusion criteria:
Cholesterol-lowering drugs
Diabetes Mellitus
Cardiovascular disease such as arrythmia, ischaemic heart disease.
Musculoskeletal disorders preventing the subject to perform physical training
Mental disorders preventing the subject to understand the project description.

Annotated entities:
- Drug: "Cholesterol-lowering drugs"
- Condition: "Diabetes Mellitus"
- Condition: "Cardiovascular disease"
- Condition: "arrythmia"
- Condition: "ischaemic heart disease"
- Condition: "Musculoskeletal disorders"
- Qualifier: "preventing the subject to perform physical training"
- Condition: "Mental disorders"
- Qualifier: "preventing the subject to understand the project description"